Clinical trial inclusion criterion:
5. Currently using carbohydrate counting as the meal insulin dose strategy.

Annotated entities:
- Parsing_Error: "5."
- Procedure: "carbohydrate counting"
- Procedure: "meal insulin dose strategy"
- Temporal: "Currently"